下列有關蟠尾絲蟲（Onchocerca volvulus）感染人體的敘述，有幾項敘述是正確的？①微絲蟲（microfilaria）也會出現在尿液中 ②微絲蟲（microfilaria）可能引起失明 ③病患皮膚可能呈現豹皮花紋（leopard skin） ④病患肺部可能有硬幣大小的結節病變（coin lesion）
A. 1項
B. 2項
C. 3項
D. 4項

正確答案：C. 3項